Current or recent treatment with pegylated interferon (PEG-IFN).

The above is a clinical trial exclusion criterion. Annotated with entity spans:
[Temporal: Current] or [Temporal: recent] [Procedure: treatment] with [Drug: pegylated interferon] ([Drug: PEG-IFN]).